Clinical trial exclusion criterion:
Congenital urogenital anomaly

Annotated entities:
- Qualifier: "Congenital"
- Condition: "urogenital anomaly"